contraindications to neuraxial anesthesia or require general anesthesia for CD

The above is a clinical trial exclusion criterion. Annotated with entity spans:
[Condition: contraindications] to [Procedure: neuraxial anesthesia] or [Mood: require] [Procedure: general anesthesia] for [Procedure: CD]